Clinical trial exclusion criterion:
Not sexually active with a male partner

Entity relations:
- Has_qualifier("sexually active", "male partner")
- Has_negation("sexually active", "Not")